Clinical trial inclusion criterion:
normal full term single pregnancy

Entity relations:
- Has_multiplier("pregnancy", "single")
- Has_qualifier("pregnancy", "full term")
- Has_qualifier("pregnancy", "normal")